Clinical trial inclusion criterion:
At least one of the knee pain VAS score is 40mm or more.

Annotated entities:
- Multiplier: "At least one"
- Condition: "knee pain"
- Measurement: "VAS score"
- Value: "40mm or more"